Atrioventricular block of second or third degree (without a pacemaker).

The above is a clinical trial exclusion criterion. Annotated with entity spans:
[Condition: Atrioventricular block of second] or third degree ([Negation: without] a [Device: pacemaker]).